陳先生到印度鄉野自助旅行數月，回來後出現腹瀉、發燒、貧血等症狀，之後並出現肝脾腫大 （hepatosplenomegaly）現象，骨髓穿刺在其巨噬細胞中發現無鞭毛體（amastigotes），血液及糞便檢查沒有其他發現，他最可能感染的寄生蟲病是：
A. 黑水熱（blackwater fever）
B. 黑熱病（black fever）
C. 絲蟲症（filariasis）
D. 卡格氏症（Chagas'disease）

正確答案：B. 黑熱病（black fever）